Clinical trial inclusion criterion:
sterile male partners

Annotated entities:
- Non-query-able: "sterile male partners"